A先生，65歲男性，有高血壓病史多年，早上吃完早飯後，突然頭暈，步態不穩，被送至急診室，身體神經功能檢查，發現講話口語不清，吞嚥困難，右側gag reflex消失，左側疼痛感覺遲鈍，其病灶最可能與下列那條血管堵塞有關？
A. 右側後下小腦動脈
B. 左側後下小腦動脈
C. 右側前下小腦動脈
D. 左側前下小腦動脈

正確答案：A. 右側後下小腦動脈